At which kind of individuals is pharmacological treatment of subclinical hypothyroidism effective in reducing cardiovascular events?

Treatment of subclinical hypothyroidism is associated with fewer cardiovascular events in younger individuals, but this issue has not been resolved yet in elderly people.